Clinical trial exclusion criteria:
ASA 3+
No current treatment plan at OHSU
Severely carious teeth resulting in inability to isolate for procedure
Unable to understand or sign consent form

Annotated entities:
- Condition: "ASA 3+"
- Mood: "treatment plan"
- Negation: "No"
- Temporal: "current"
- Visit: "OHSU"
- Condition: "carious teeth"
- Qualifier: "Severely"
- Condition: "inability to isolate for procedure"
- Post-eligibility: "Unable to understand or sign consent form"